vulnerable study subjects such as described in Finnish law concerning clinical studies (disabled, children, pregnant or breast-feeding women, prisoners) will not be included.

The above is a clinical trial exclusion criterion. Annotated with entity spans:
[Condition: vulnerable] study subjects such as described in [Qualifier: Finnish law concerning clinical studies] ([Condition: disabled], [Person: children], [Condition: pregnant] or [Condition: breast-feeding] [Person: women], [Observation: prisoners]) will not be included.